Acute disease at the time of enrolment.

The above is a clinical trial exclusion criterion. Annotated with entity spans:
[Condition: Acute disease] [Temporal: at the time of enrolment].